關於鼻竇黏液囊腫（mucocele），下列敘述何者錯誤？
A. 最好發於上頷竇（maxillary sinus）
B. 注射對比劑的電腦斷層檢查，多不會顯影
C. 可造成病灶處鼻竇擴張（expansion）
D. 可影響眼眶而造成複視

正確答案：A. 最好發於上頷竇（maxillary sinus）